Clinical trial inclusion criterion:
Patient with moderate or severe chronic atopic dermatitis

Entity relations:
- Has_qualifier("chronic atopic dermatitis", "moderate")
- OR("moderate", "severe")